Acquired or congenital immunodeficiency;

The above is a clinical trial exclusion criterion. Annotated with entity spans:
[Condition: Acquired] or [Condition: congenital immunodeficiency];